Interested in quitting smoking

The above is a clinical trial inclusion criterion. Annotated with entity spans:
[Post-eligibility: Interested in quitting smoking]